At least one void.

The above is a clinical trial inclusion criterion. Annotated with entity spans:
[Multiplier: At least one] [Observation: void].